Clinical trial exclusion criteria:
Any anti-coagulation therapy (apart from rivaroxaban for second objective)
Hypersensitivity or allergy to factor Xa inhibitors
Acute bacterial endocarditis
Bleeding disorder
Clinically relevant active bleeding
Gastrointestinal ulcer or tumor
Hepatic dysfunction with increased bleeding risk
Renal failure / patients undergoing dialysis
Pregnancy and breast feeding
Gastrectomy, biliopancreatic diversion, resection or re-routing of small intestines
Feeding tube
Recent blood donation
Abnormalities of laboratory values: alanine-aminotransferase (ALAT), aspartate-aminotransferase (ASAT), gamma-glutamyl transferase (gammaGT), alkalic phosphatase (AP), bilirubin, amylase, lipase, cystatin C, creatinine, white blood cell count, haemoglobin, platelet count, prothrombin time, aPTT, fibrinogen, thrombin time, factors II,V,VII and X
Use of therapeutic or recreational drugs influencing plasmatic coagulation

Annotated entities:
- Procedure: "anti-coagulation therapy"
- Drug: "rivaroxaban"
- Negation: "apart from"
- Condition: "Hypersensitivity"
- Condition: "allergy"
- Drug: "factor Xa inhibitors"
- Condition: "Acute bacterial endocarditis"
- Condition: "Bleeding disorder"
- Condition: "active bleeding"
- Condition: "Gastrointestinal ulcer"
- Condition: "Gastrointestinal tumor"
- Condition: "Hepatic dysfunction"
- Observation: "bleeding risk"
- Qualifier: "increased"
- Condition: "Renal failure"
- Procedure: "dialysis"
- Pregnancy_considerations: "Pregnancy and breast feeding"
- Procedure: "Gastrectomy"
- Procedure: "biliopancreatic diversion"
- Procedure: "re-routing"
- Procedure: "resection"
- Qualifier: "small intestines"
- Device: "Feeding tube"
- Observation: "blood donation"
- Measurement: "alanine-aminotransferase"
- Measurement: "ALAT"
- Measurement: "aspartate-aminotransferase"
- Measurement: "ASAT"
- Measurement: "gamma-glutamyl transferase"
- Measurement: "gammaGT"
- Measurement: "alkalic phosphatase"
- Measurement: "AP"
- Measurement: "bilirubin"
- Measurement: "amylase"
- Measurement: "lipase"
- Measurement: "cystatin C"
- Measurement: "creatinine"
- Measurement: "white blood cell count"
- Measurement: "haemoglobin"
- Measurement: "platelet count"
- Measurement: "prothrombin time,"
- Measurement: "aPTT"
- Measurement: "fibrinogen"
- Measurement: "thrombin time"
- Measurement: "factors II"
- Measurement: "factors V"
- Measurement: "factors VII"
- Measurement: "factors X"
- Value: "Abnormalities"
- Non-query-able: "Use of therapeutic or recreational drugs influencing plasmatic coagulation"